Has an active autoimmune disease that has required systemic treatment in the past 2 years. Replacement therapy is not considered a form of systemic treatment.

The above is a clinical trial exclusion criterion. Annotated with entity spans:
Has an [Temporal: active] [Condition: autoimmune disease] that has required [Procedure: systemic treatment] [Temporal: in the past 2 years]. [Not_a_criteria: Replacement therapy is not considered a form of systemic treatment.]